37 歲男性，BMI 為 38 kg/m2，主訴晚上睡覺時有胸痛現象約半年，其疼痛只局限於前胸，常伴有燒灼感及胃酸溢出感，作為診斷的依據，下列何種檢查不需要？
A. UGI endoscopic examination
B. 24hr esophageal pH monitor
C. Esophageal manometer examination
D. Hypotonic duodenography

正確答案：D. Hypotonic duodenography